Clinical trial exclusion criterion:
Diagnosis of a psychotic disorder.

Annotated entities:
- Condition: "psychotic disorder"